Clinical trial exclusion criterion:
Contraindication of MRI Claustrophobia Metallic hazards Pacemaker implant eGFR<30 ml/min

Annotated entities:
- Condition: "Contraindication"
- Procedure: "MRI"
- Condition: "Claustrophobia"
- Condition: "Metallic hazards"
- Device: "Pacemaker implant"
- Measurement: "eGFR"
- Value: "<30 ml/min"